Clinical trial exclusion criterion:
Subjects with HIV positive result at the screening

Entity relations:
- Has_temporal("HIV positive", "at the screening")